Clinical trial exclusion criteria:
Patients with azathioprine or biologics therapy

Annotated entities:
- Drug: "azathioprine"
- Drug: "biologics"
- Procedure: "therapy"